Clinical trial inclusion criterion:
Eligible for heat treatment

Entity relations:
- Has_mood("heat treatment", "Eligible for")